Clinical trial inclusion criterion:
Partial thromboplastin time (PTT) must be </= 1.5 x upper normal limit of institution's normal range and INR (International Normalized Ratio) < 1.5.

Entity relations:
- Has_value("INR (International Normalized Ratio)", "< 1.5")
- Has_value("Partial thromboplastin time (PTT)", "</= 1.5 x upper normal limit")